Clinical trial exclusion criterion:
Angina

Annotated entities:
- Condition: "Angina"